Patients with systolic blood pressure <100 mmHg or basal heart rate <60/min

The above is a clinical trial exclusion criterion. Annotated with entity spans:
Patients with [Measurement: systolic blood pressure] [Value: <100 mmHg] or [Qualifier: basal] [Measurement: heart rate] [Value: <60/min]